Inclusion criteria includes all U.S. HCA hospitals with an adult ICU;

The above is a clinical trial inclusion criterion. Annotated with entity spans:
Inclusion criteria includes all [Visit: U.S.] [Visit: HCA hospitals] with an [Visit: adult ICU];